腦瘤長在大腦半球間區域（interhemispheric region）之額－頂葉區（frontal-parietal area），患者最可能會有下列何種症狀？
A. 一側臉部感覺異常
B. 膝腱反射（knee jerk reflex）減弱或消失
C. 上、下肢體所有感覺功能消失
D. 肌肉無力症狀在下肢較明顯

正確答案：D. 肌肉無力症狀在下肢較明顯